Clinical trial exclusion criterion:
major axial deviation (varus >5° , valgus > 5°),

Annotated entities:
- Condition: "major axial deviation"
- Measurement: "varus"
- Measurement: "valgus"
- Value: ">5°"
- Value: "> 5°"